珠珠接受開刀過程都很順利，寶寶也馬上由小兒科醫師接手進一步處置，開刀中發現子宮局部呈現藍紫色，因為收縮不佳，出血多達 1500 mL，心跳也增加到每分鐘 133 下，在給予 Oxytocin、Ergonovine 及 Prostaglandins 類藥物後，主治醫師決定進行 B-Lynch 縫合手術，並馬上給予輸液及輸血治療，情況才逐漸穩定。下列敘述何者正確？
A. 藍紫色子宮（Couvelaire uterus）成因是因為子宮乏力（Uterine atony）收縮不佳形成的
B. 珠珠出現子宮乏力伴隨大出血的原因可能跟出現胎盤剝離的危險因子相關
C. B-Lynch 縫合手術主要是阻斷子宮動脈血流以期減緩出血的一種方法
D. 懷孕後期血管內容積平均增加 1500 至 2000 mL，因此容易高估真正產後的出血量

正確答案：B. 珠珠出現子宮乏力伴隨大出血的原因可能跟出現胎盤剝離的危險因子相關